有關蝕骨細胞（osteoclast）的敘述，下列何者錯誤？
A. 位於吸收陷窩（Howship's lacunae）
B. 多核
C. 細胞質內具有許多溶酶體（lysosomes）
D. 細胞質呈嗜鹼性

正確答案：D. 細胞質呈嗜鹼性